下列那一條肌肉不屬於肩關節旋轉肌袖群（rotator cuff）？
A. 肩胛下肌（subscapularis）
B. 岡下肌（infraspinatus）
C. 岡上肌（supraspinatus）
D. 大圓肌（teres major）

正確答案：D. 大圓肌（teres major）